Clinical trial exclusion criterion:
Any other confounding bladder or urethral pathology, including urethral stricture, bladder neck contracture, or bladder atonia

Entity relations:
- Subsumes("bladder pathology", "urethral stricture")
- OR("urethral stricture", "bladder neck contracture", "bladder atonia")
- OR("bladder pathology", "urethral pathology")